Clinical trial inclusion criterion:
Use of Ace Inh and ARB for control of blood pressure who are willing to be placed on alternate drug(s) in the washout period for blood pressure control

Annotated entities:
- Drug: "Ace Inh"
- Drug: "ARB"
- Procedure: "control of blood pressure"
- Informed_consent: "willing to be placed on alternate drug(s) in the washout period for blood pressure control"